某研究於 1965 年調查 3000 名台北市成年男性的飲酒情況，並在 1981~1995 年間調查這些成年男性罹患癌症的情形，這種研究設計是屬於：
A. 橫斷性研究（cross-sectional study）
B. 世代研究（cohort study）
C. 病例對照研究（case-control study）
D. 社區生態研究（community ecological trial）

正確答案：B. 世代研究（cohort study）